Clinical trial exclusion criterion:
Patients using chronic oral neuromodulators

Annotated entities:
- Drug: "chronic oral neuromodulators"